Clinical trial inclusion criterion:
Arrestees examined by a physician during detention in police cells

Annotated entities:
- Person: "Arrestees"
- Temporal: "during detention in police cells"
- Reference_point: "detention in police cells"
- Procedure: "examined by a physician"